List 3 NK3R antagonists.

NK3 receptor antagonists include MLE4901 (also known as AZD4901), SB222200 and ESN364.